Mini-mental State Examination (MMSE) [18] score = 23.

The above is a clinical trial exclusion criterion. Annotated with entity spans:
[Measurement: Mini-mental State Examination (MMSE)] [18] score [Value: = 23].